En el marco de la Teoría de la Autodiscrepancia (E.T. Higgins), a los aspectos del yo que contienen información sobre las aspiraciones, metas, expectativas o deseos, se les denomina:
1. Yo Real.
2. Yo Ideal.
3. Yo Debería.
4. Autoconcepto.
5. Ego.

Respuesta correcta: 2. Yo Ideal.